Clinical trial exclusion criterion:
received antiviral therapy for any systemic anti-viral, anti-neoplastic or immuno-modulatory treatment (including supraphysiologic doses of steroids and radiation) within the past 6 months.

Entity relations:
- AND("antiviral therapy", "systemic anti-viral")
- Has_multiplier("steroids", "supraphysiologic doses")
- Has_multiplier("radiation", "supraphysiologic doses")
- Subsumes("antiviral therapy", "steroids")
- Has_temporal("antiviral therapy", "within the past 6 months")
- OR("steroids", "radiation")
- OR("antiviral therapy", "immuno-modulatory treatment", "anti-neoplastic treatment")